Clinical trial exclusion criterion:
History of other significant skin disease, or skin manifestations of allergic illness or other dermatologic condition, except chronic moderate or severe atopic dermatitis, that would interfere with the trial assessments or compromise the patient's safety according to the opinion of the Investigator

Entity relations:
- Has_qualifier("skin disease", "significant")
- AND("skin manifestations", "allergic illness")
- Has_qualifier("atopic dermatitis", "chronic moderate")
- Has_negation("atopic dermatitis", "except")
- AND("skin manifestations", "atopic dermatitis")
- OR("allergic illness", "dermatologic condition")
- OR("chronic moderate", "severe")
- OR("skin disease", "skin manifestations")